chronic renal insufficiency requiring dialysis

The above is a clinical trial inclusion criterion. Annotated with entity spans:
[Condition: chronic renal insufficiency] requiring [Procedure: dialysis]